Las moléculas HLA de clase I se expresan en:
1. Leucocitos.
2. Eritrocitos.
3. Todas las células nucleadas.
4. Células presentadoras de antígeno.
5. Linfocitos NK.

Respuesta correcta: 3. Todas las células nucleadas.